Clinical trial inclusion criterion:
3. Surface ulcer with an area > 15cm2 post debridement

Annotated entities:
- Parsing_Error: "3."
- Condition: "Surface ulcer"
- Value: "> 15cm2"
- Measurement: "area post debridement"